Clinical trial exclusion criterion:
anaemia (Hb <105 g/L [10.5 g/dL]) at inclusion, lack of informed consent

Annotated entities:
- Condition: "anaemia"
- Measurement: "Hb"
- Value: "<105 g/L"
- Value: "10.5 g/dL"
- Temporal: "at inclusion"
- Informed_consent: "lack of informed consent"